Clinical trial inclusion criterion:
Aged between 18 and 75

Entity relations:
- Has_value("Aged", "between 18 and 75")